Clinical trial inclusion criterion:
Male and females between ages 18-85 years of age

Entity relations:
- Has_value("ages", "between 18-85 years of age")
- OR("l", "females")